Clinical trial inclusion criterion:
American Society of Anesthesiology class I-III

Entity relations:
- Has_value("American Society of Anesthesiology class", "I-III")